Mujer de 84 años que acude por pérdida de visión en el ojo izquierdo de 4 días de evolución acompañada de metamorfopsias. En la mácula se aprecian abundantes exudados duros, dos pequeñas hemorragias profundas y un desprendimiento de la retina neurosensorial localizado. En el ojo contralateral presenta abundantes drusas blandas. Ante este cuadro, ¿Cuál de los siguientes diagnósticos le parece más probable?
1. Desprendimiento posterior de vítreo agudo.
2. Degeneración Macular Asociada a la Edad (DMAE) Exudativa.
3. Obstrucción de arteria central de la retina.
4. Neuropatía óptica isquémica anterior no arterítica.

Respuesta correcta: 2. Degeneración Macular Asociada a la Edad (DMAE) Exudativa.